Patients undergoing total knee arthroplasty under spinal anaesthesia

The above is a clinical trial inclusion criterion. Annotated with entity spans:
Patients undergoing [Procedure: total knee arthroplasty] under [Procedure: spinal anaesthesia]